Clinically positive axillary nodes

The above is a clinical trial exclusion criterion. Annotated with entity spans:
Clinically [Qualifier: positive] [Condition: axillary nodes]